醫院的分類，若以醫院經營管理角度來看，國內的醫院主要是屬於何種醫院制度？
A. 開放性（open staff system）
B. 封閉性（close staff system）
C. 半開放性（semi-open staff system）
D. 半封閉性（semi-close staff system）

正確答案：B. 封閉性（close staff system）